Clinical trial exclusion criterion:
Presence of another pathology that could influence exercise tolerance

Annotated entities:
- Qualifier: "another"
- Condition: "pathology"
- Qualifier: "influence exercise tolerance"